通過第三及第四腰椎間的椎間盤的平面為：
A. 橫幽門面（transpyloric plane）
B. 橫臍面（transumbilical plane）
C. 橫腸骨結節面（transtubercular plane）
D. 腸骨嵴間面（intercristal plane）

正確答案：B. 橫臍面（transumbilical plane）